Contraindication to antiplatelet therapy

The above is a clinical trial exclusion criterion. Annotated with entity spans:
[Condition: Contraindication] to [Drug: antiplatelet therapy]